下列有關胰臟癌（carcinoma of the pancreas）的敘述，何者錯誤？
A. 壺腹周圍癌（periampullary carcinoma）以胰臟頭部癌佔最多
B. 胰臟癌病人血清中癌胚抗原（CEA）及鎖糖抗原（CA19-9）都會上升，是早期診斷的重要依據
C. 電腦斷層掃描（CT scan）及內視鏡超音波（EUS）比一般超音波（ultrasonography）診斷率好
D. 胰頭部癌之外科治療，可採用 Whipple procedure（radical pancreatico-duodenal resection）

正確答案：B. 胰臟癌病人血清中癌胚抗原（CEA）及鎖糖抗原（CA19-9）都會上升，是早期診斷的重要依據